Please list 10 conditions which play a role in causing atrial fibrillation.

Atrial fibrillation (AF) is the most common sustained arrhythmia and is associated with significant morbidity and mortality. Multiple conditions like hypertension, heart failure, diabetes, sleep apnoea, hyperthyroidism and obesity play a role for the initiation and perpetuation of AF. Other possible causes are alcohol and drug use and atrial ischemia. Risk of AF increases with age.